Clinical trial exclusion criterion:
on anticoagulation

Entity relations:
- multi("anticoagulation", "anticoagulation")